Clinical trial exclusion criterion:
If local anesthetic allergy is present

Entity relations:
- AND("allergy", "local anesthetic")